Clinical trial exclusion criterion:
History or current evidence of wasting, autoimmune (such as rheumatoid arthritis and systemic lupus erythematosus) or connective tissue diseases

Entity relations:
- Subsumes("autoimmune diseases", "rheumatoid arthritis")
- Subsumes("wasting", "History")
- OR("rheumatoid arthritis", "systemic lupus erythematosus")
- OR("wasting", "connective tissue diseases", "autoimmune diseases")
- OR("History", "current")